Clinical trial inclusion criterion:
6. Patients with HIV neuropathy must have had HIV, subjective symptoms of painful peripheral neuropathy, and daily painful symptoms of at least 3 months' duration

Annotated entities:
- Condition: "HIV neuropathy"
- Condition: "HIV"
- Condition: "subjective symptoms"
- Condition: "peripheral neuropathy"
- Qualifier: "painful"
- Multiplier: "daily"
- Condition: "painful symptoms"
- Temporal: "at least 3 months' duration"